Life limiting disease or substance abuse which may affect participation

The above is a clinical trial exclusion criterion. Annotated with entity spans:
[Condition: Life limiting disease] or [Condition: substance abuse] which [Qualifier: may affect participation]